Clinical trial inclusion criterion:
Subjects aged 18 to 80 years old

Entity relations:
- Has_value("aged", "18 to 80 years old")